下列有關 inhibitory postsynaptic potentials（IPSPs）之敘述，何者正確？
A. 為 all-or-none 訊號
B. 可在神經細胞被傳遞長距離，傳遞過程中訊號大小不會改變
C. 在中樞神經系統引起 IPSPs 的主要 transmitter 是 glutamate
D. 為 graded hyperpolarization 訊號

正確答案：D. 為 graded hyperpolarization 訊號